下列那種細胞可同時分泌下列產物？(r) 抑制素（inhibin） @ 雄性素結合蛋白（androgen binding protein） (r) 睪丸運鐵蛋白（testicular transferrin）
A. 精原母細胞（spermatogonia）
B. 纖維母細胞（fibroblast）
C. 萊迪氏細胞（leydig cell）
D. 塞托利細胞（sertoli cell）

正確答案：D. 塞托利細胞（sertoli cell）